Clinical trial exclusion criterion:
Patients used to alcohol or drug (medication) abuse;

Annotated entities:
- Condition: "alcohol abuse"
- Condition: "drug abuse"
- Condition: "medication abuse"